Clinical trial exclusion criterion:
Currently take bisphosphonates, estrogen replacement therapy, glucocorticosteroids, or other drugs affecting bone

Annotated entities:
- Drug: "bisphosphonates"
- Procedure: "estrogen replacement therapy"
- Drug: "glucocorticosteroids"
- Drug: "drugs affecting bone"
- Undefined_semantics: "drugs affecting bone"